兒童出現下列何種症狀時，不需要考慮有腎臟疾病的存在？
A. 長期小便有泡泡（foamy urine）
B. 多尿（polyuria）
C. 生長遲滯（growth retardation）
D. 尿道口疼痛（pain of urethral orifice）

正確答案：D. 尿道口疼痛（pain of urethral orifice）